有關 Epstein-Barr virus 感染的敘述，何者錯誤？
A. 好發於年輕人
B. 感染性單核球增多症（infectious mononucleosis）以發燒、喉嚨痛以及淋巴結病變為典型的臨床症狀
C. 實驗室檢查會有 lymphocytosis 以及大於 10%的 atypical lymphocyte
D. anti-EBNA 陽性表示處於急性感染期

正確答案：D. anti-EBNA 陽性表示處於急性感染期